Clinical trial exclusion criterion:
Anatomical abnormalities preventing successful peripheral catheter insertion

Entity relations:
- AND("insertion", "peripheral catheter")
- Has_qualifier("insertion", "successful")
- Has_mood("insertion", "preventing")
- multi("preventing", "preventing")
- AND("Anatomical abnormalities", "insertion")